Clinical trial inclusion criterion:
undergoing elective tonsillectomy with or without adenoidectomy

Entity relations:
- Has_qualifier("tonsillectomy", "elective")
- AND("tonsillectomy", "adenoidectomy")